一位28歲年輕人，胸部遭受槍擊造成血胸（hemothorax）合併休克，胸管引流出800 ml血液後，血壓恢復為 mmHg， 心跳96下/分鐘，幾分鐘後血壓下降為86/68 mmHg，心跳136下/分鐘，下列處置何者優先？
A. 立即氣管插管
B. 緊急開胸手術
C. 立即輸血
D. 重新評估病人

正確答案：D. 重新評估病人